NO es un componente de la etapa de evaluación del Proceso de Enfermería:
1. La recogida de datos relacionados con los resultados.
2. La comparación de los datos con los resultados deseados.
3. La relación de las actividades enfermeras con los resultados.
4. La continuación, modificación o terminación del plan de cuidados.
5. La elección de resultados pertinentes y determinación de indicadores precisos.

Respuesta correcta: 5. La elección de resultados pertinentes y determinación de indicadores precisos.